Age >=19 patients who complained of dizziness

The above is a clinical trial inclusion criterion. Annotated with entity spans:
[Person: Age] [Value: >=19] patients who complained of [Condition: dizziness]